Clinical trial inclusion criterion:
5. HIV-negative as determined by a HIV rapid test at time of enrollment

Entity relations:
- Has_value("HIV", "negative")
- multi("HIV-negative", "HIV")
- Has_temporal("HIV rapid test", "at time of enrollment")
- AND("HIV-negative", "HIV rapid test")
- Has_index("at time of enrollment", "time of enrollment")